Un adolescente con trastorno obsesivocompulsivo telefonea al Servicio Médico de Información Toxicológica para preguntar si puede utilizar sin peligro un insecticida para cucarachas. ¿Cómo se denomina esta conducta de escape?
1. Averiguación.
2. Racionalización.
3. Reaseguración.
4. Ritualización.
5. Comprobación.

Respuesta correcta: 3. Reaseguración.